下列何項藥物可以用來治療不孕症？
A. Mifepristone
B. Danazol
C. Clomiphene
D. Flutamide

正確答案：C. Clomiphene